肩關節脫位（dislocation）最易損及下列何者？
A. 肌皮神經（musculocutaneous nerve）
B. 橈神經（radial nerve）
C. 腋神經（axillary nerve）
D. 尺神經（ulnar nerve）

正確答案：C. 腋神經（axillary nerve）